Clinical trial inclusion criterion:
Two well-characterized mutations in the cystic fibrosis transmembrane conductance regulator (CFTR) gene

Entity relations:
- Subsumes("cystic fibrosis transmembrane conductance regulator gene", "CFTR")
- Has_multiplier("mutations", "Two")